Clinical trial exclusion criterion:
Presence or history of relevant hepatic disease as judged by the investigator

Entity relations:
- Has_qualifier("hepatic disease", "relevant")